no written informed consent

The above is a clinical trial inclusion criterion. Annotated with entity spans:
[Non-query-able: no written informed consent]